Clinical trial exclusion criterion:
Seizure occurred by metabolic factors (hypoglycemia, hypocalcemia, electrolyte disorder)

Entity relations:
- Subsumes("metabolic factors", "hypoglycemia")
- Has_qualifier("Seizure", "metabolic factors")
- OR("hypoglycemia", "hypocalcemia", "electrolyte disorder")